Clinical trial exclusion criterion:
Surgically altered biliary tract anatomy, not including prior cholecystectomy

Entity relations:
- Has_temporal("cholecystectomy", "prior")
- Has_negation("cholecystectomy", "not")
- AND("Surgically altered biliary tract anatomy", "cholecystectomy")